Un joven de 20 años, con clínica de ataxia, cefaleas y masa sólido-quística en hemisferio cerebeloso derecho, es intervenido quirúrgicamente, resecándose una lesión que histológicamente muestra células con procesos citoplasmáticos largos y finos, patrón fascicular y microquístico, numerosos vasos y fibras de Rosenthal. El diagnóstico antomopatológico más probable es:
1. Astrocitoma pilocítico.
2. Xantoastrocitoma pleomórfico.
3. Neurocitoma central.
4. Liponeurocitoma.
5. Enfermedad por priones.

Respuesta correcta: 1. Astrocitoma pilocítico.